Clinical trial exclusion criterion:
Patients with severe and/or uncontrolled concurrent medical disease that in the opinion of the investigator could cause unacceptable safety risks or compromise compliance with the protocol.

Annotated entities:
- Condition: "medical disease"
- Undefined_semantics: "medical disease"
- Temporal: "concurrent"
- Qualifier: "uncontrolled"
- Qualifier: "severe"
- Subjective_judgement: "in the opinion of the investigator"
- Non-query-able: "Patients with severe and/or uncontrolled concurrent medical disease that in the opinion of the investigator could cause unacceptable safety risks or compromise compliance with the protocol."